Clinical trial inclusion criterion:
Absolute neutrophil count (ANC) >= 1250/ul

Annotated entities:
- Measurement: "Absolute neutrophil count"
- Measurement: "ANC"
- Value: ">= 1250/ul"